History of hypersensitivity/intolerance to any components of the study inhalers (example, lactose, magnesium stearate). In addition, subjects with a history of severe milk protein allergy that, in the opinion of the study physician, contraindicates participation will also be excluded.

The above is a clinical trial exclusion criterion. Annotated with entity spans:
History of [Condition: hypersensitivity]/[Condition: intolerance] to any [Drug: components of the study inhalers] (example, [Drug: lactose], [Drug: magnesium stearate]). In addition, subjects with a [Temporal: history] of [Qualifier: severe] [Drug: milk protein] [Condition: allergy] that, [Non-query-able: in the opinion of the study physician], [Condition: contraindicates participation] will also be excluded.